Clinical trial exclusion criterion:
Dilantin and oral contraceptive usage due to potential drug interaction with glitazones

Annotated entities:
- Drug: "Dilantin"
- Drug: "oral contraceptive"
- Condition: "drug interaction"
- Drug: "glitazones"
- Mood: "potential"